一位 25 歲女性，訴說常常在月經的前兩天開始就感到劇烈的下腹疼痛，疼痛並且一直持續到月經結束，這已經持續有一年的時間。在此之前，她通常是在月經來的第一天才會感覺到疼痛。她自行吃止痛藥，但無法改善症狀。因此到婦產科醫院求診，經超音波檢查後，發現左側卵巢有個 6 公分的卵巢囊腫。她向來月經週期都很準時是 28 天，每次也都持續約 5 天左右，經血量也沒什麼特別之處。醫師在診查之後，心中已有初步臆斷，因此處方黃體素給予治療。果然，投藥後疼痛症狀即稍有改善。 你覺得最可能的診斷是：
A. 卵巢功能退化
B. 子宮肌瘤
C. 黃體囊腫
D. 子宮內膜異位

正確答案：D. 子宮內膜異位